Clinical trial inclusion criterion:
= 3 UTIs within the last 12 months or = 2 UTIs within the last 6 months;

Entity relations:
- Has_multiplier("UTIs", "= 3")
- Has_multiplier("UTIs", "= 2")
- Has_temporal("UTIs", "within the last 6 months")
- Has_temporal("UTIs", "within the last 12 months")
- OR("UTIs", "UTIs")